一般淋巴瘤的分期檢查，不包括下列那一項？
A. 骨髓穿刺及切片檢查
B. 骨頭掃描
C. 胸部 X 光攝影
D. 腹部及骨盆腔電腦斷層攝影

正確答案：B. 骨頭掃描